El tratamiento de primera línea más adecuado en el linfoma de Hodgkin clásico en estadio IIA es:
1. Quimioterapia tipo CHOP (6 ciclos).
2. Quimioterapia tipo ABVD (2-4 ciclos) seguido de radioterapia en campo afecto.
3. Quimioterapia tipo ABVD (4 ciclos) seguida de trasplante autólogo de progenitores hematopoyéticos.
4. Radioterapia en campo ampliado (ej. tipo Mantle o tipo “Y invertida).
5. Radioterapia en campos afectos.

Respuesta correcta: 2. Quimioterapia tipo ABVD (2-4 ciclos) seguido de radioterapia en campo afecto.